Clinical trial exclusion criterion:
Untreated inflow disease of the ipsilateral pelvic arteries (more than 50%stenosis or or occlusion

Annotated entities:
- Qualifier: "Untreated"
- Condition: "inflow disease"
- Qualifier: "ipsilateral pelvic arteries"
- Value: "more than 50%"
- Condition: "stenosis"
- Value: "occlusion"